Clinical trial inclusion criterion:
Psychiatric illness

Annotated entities:
- Condition: "Psychiatric illness"